Clinical trial exclusion criterion:
Subjects currently consuming =5 units of alcohol per day

Annotated entities:
- Temporal: "currently"
- Observation: "consuming alcohol per day"
- Value: "=5 units"